pregnancy or breastfeeding (female participants with childbearing potential were required to use medically accepted contraception for the duration of the study)

The above is a clinical trial exclusion criterion. Annotated with entity spans:
[Pregnancy_considerations: pregnancy or breastfeeding (female participants with childbearing potential were required to use medically accepted contraception for the duration of the study)]